Clinical trial exclusion criterion:
Use of medication such as oral glucocorticoids, anti-estrogens or other medications that are known to markedly influence insulin sensitivity.

Entity relations:
- Has_qualifier("medications", "other")
- Has_qualifier("oral glucocorticoids", "markedly influence insulin sensitivity")
- OR("oral glucocorticoids", "anti-estrogens", "medications")